El enlace peptídico:
1. Se mantiene por un puente de hidrógeno entre CO y el NH.
2. Es un enlace de tipo amida.
3. Se rompe cuando la proteína se desnaturaliza.
4. Es un enlace simple covalente, carece de libertad de giro.

Respuesta correcta: 2. Es un enlace de tipo amida.